溶小體貯積症是由於溶小體中的某一項水解酵素缺乏所導致，如高雪氏症、龐貝氏症、以及黏多醣貯積症等。目前有一項新的治療，在工廠利用細胞製造出溶小體酵素，再用靜脈注射的方法打回患者體內。有關此酵素補充治療，那一項敘述錯誤？
A. 打入患者體內的酵素，被細胞攝取後送到溶小體中發揮其功能
B. 這些注入患者體內的蛋白質大分子，有可能被身體視為異物而產生抗體
C. 這些大分子蛋白質很容易進入腦部，緩解患者之神經症狀
D. 黏多醣貯積症引起的骨骼病變，治療後常常不容易恢復

正確答案：C. 這些大分子蛋白質很容易進入腦部，緩解患者之神經症狀